Clinical trial exclusion criteria:
Less than 30 yrs of age or > 65 yrs of age
Any significant co-morbidities, such as active heart, kidney, or liver diseases, accelerated or malignant hypertension, heart failure, severe anemia.

Annotated entities:
- Value: "Less than 30 yrs"
- Person: "age"
- Value: "> 65 yrs"
- Person: "age"
- Qualifier: "significant"
- Condition: "co-morbidities"
- Qualifier: "active"
- Condition: "diseases heart"
- Condition: "diseases kidney"
- Condition: "liver diseases"
- Qualifier: "malignant"
- Qualifier: "accelerated"
- Condition: "hypertension"
- Condition: "heart failure"
- Condition: "severe anemia"